Age greater than or equal to 18 years of age

The above is a clinical trial inclusion criterion. Annotated with entity spans:
[Person: Age] [Value: greater than or equal to 18 years] of age